Factors that could have an effect on oral medication (such as inability to swallow, chronic diarrhea and intestinal obstruction);

The above is a clinical trial exclusion criterion. Annotated with entity spans:
Factors that could have an effect on oral medication (such as [Condition: inability to swallow], [Condition: chronic diarrhea] and [Condition: intestinal obstruction]);